當樣本統計量與母群體母數之差的平均值為 0，亦即統計量的期望值等於母數。此統計量具有下列何種統計學特性？
A. 有效性
B. 一致性
C. 充分性
D. 不偏性

正確答案：D. 不偏性